Clinical trial exclusion criterion:
Patients who have taken either morphine with daily dose more than 120mg or Fentanyl with daily dose more than 50ug/hr

Entity relations:
- Has_multiplier("morphine", "daily dose more than 120mg")
- Has_multiplier("Fentanyl", "daily dose more than 50ug/hr")
- OR("morphine", "Fentanyl")